Total bilirubin > 2 x ULN

The above is a clinical trial exclusion criterion. Annotated with entity spans:
[Measurement: Total bilirubin] [Value: > 2 x ULN]